Ambulatory (defined as able to ambulate at least 10 meters, with or without assistance).

The above is a clinical trial inclusion criterion. Annotated with entity spans:
[Person: Ambulatory] ([Non-query-able: defined as able to ambulate at least 10 meters, with or without assistance]).